Which subcortical brain structure is influenced the most by common genetic variants?

The putamen is the most influenced by common genetic variants. It is the subcortical brain structure responsible for learning and memory consolidation.